Clinical trial exclusion criterion:
patients with opening of cervical internal os (4 mm of dilatation at the time of consultation);

Entity relations:
- Has_value("opening of cervical internal os", "4 mm of dilatation")